The participant has Modified Hoehn & Yahr stage 5 (or stage 5 at eather on-time or off-time for the participant with wearing off phenomenon).

The above is a clinical trial exclusion criterion. Annotated with entity spans:
The participant has [Measurement: Modified Hoehn & Yahr] [Value: stage 5] (or [Value: stage 5] [Temporal: at] eather on-time or off-time for the participant with [Condition: wearing off phenomenon]).